secondary diabetes

The above is a clinical trial exclusion criterion. Annotated with entity spans:
[Qualifier: secondary] [Condition: diabetes]